Patient diagnosed by HRCT Core Lab with eligible heterogeneous disease distribution and at least one complete oblique fissure.

The above is a clinical trial inclusion criterion. Annotated with entity spans:
Patient diagnosed by [Procedure: HRCT Core Lab] with eligible [Condition: heterogeneous disease distribution] and [Multiplier: at least one] [Condition: complete oblique fissure].